在二手菸對於肺氣腫的病例對照研究中，選擇對照組的主要目的是：
A. 估計背景族群（source population）暴露之比例
B. 估計背景族群（source population）疾病之發病率
C. 去除安慰作用（placebo effect）
D. 增加取樣的效率

正確答案：A. 估計背景族群（source population）暴露之比例